克隆氏疾病（Crohn's disease）最常見的症狀為何？
A. 腹瀉及腹痛
B. 直腸流血
C. 肛門膿瘍
D. 腸道皮膚廔管

正確答案：A. 腹瀉及腹痛